Clinical trial exclusion criterion:
mental retardation or organic brain damage

Annotated entities:
- Condition: "mental retardation"
- Condition: "organic brain damage"